Clinical trial exclusion criterion:
13. Mobitz Type II or III° atrial ventricular block，severe ventricular arrhythmia (polymorphic and frequent premature ventricular beats, frequent non-sustained ventricular tachycardia);

Annotated entities:
- Measurement: "Mobitz"
- Value: "Type II or III"
- Condition: "atrial ventricular block"
- Qualifier: "severe"
- Condition: "ventricular arrhythmia"
- Observation: "premature ventricular beats"
- Condition: "ventricular tachycardia"
- Qualifier: "non-sustained"
- Multiplier: "frequent"
- Multiplier: "frequent"
- Qualifier: "polymorphic"